下列關於脂蛋白（lipoprotein）的敘述，何者錯誤？
A. 脂蛋白含脂質與蛋白質，它負責運送膽固醇（cholesterol）、磷脂質（phospholipid）與三酸甘油脂
B. ApoC-II 會促進血液中三酸甘油脂之分解
C. 含蛋白質量最多的脂蛋白是高密度脂蛋白（HDL, high density lipoprotein）
D. 運送肝臟細胞所合成的三酸甘油脂到周邊組織的脂蛋白為乳糜微粒（chylomicrons）

正確答案：D. 運送肝臟細胞所合成的三酸甘油脂到周邊組織的脂蛋白為乳糜微粒（chylomicrons）